Which genes are regulated by TRalpha2  in the heart?

ARB1, ARB2, TAK1, p38, TRalpha1